Clinical trial exclusion criterion:
Existing sacral pressure ulcer, undergoing a cardiac procedure, or inability to provide informed consent.

Entity relations:
- OR("sacral pressure ulcer", "inability to provide informed consent", "cardiac procedure")